下列關於痔瘡（hemorrhoids）的敘述，何者正確？
A. 痔瘡為黏膜下的血管組織增生，又可稱為肛門靜脈曲張
B. 目前認為痔瘡功能為協助肛門口的關閉及節制排便
C. 因痔瘡有可能會發展成惡性腫瘤，一旦發現痔瘡須馬上積極處理
D. 如在診間發現患者有血栓性外痔瘡，可以在診間考慮使用痔瘡結紮術

正確答案：B. 目前認為痔瘡功能為協助肛門口的關閉及節制排便